下列有關肺炎合併肋膜積液治療之敘述，何者錯誤？
A. pH＜7.0 應引流治療
B. 白血球＞10000/mm3 應引流治療
C. LDH＞1000 unit/L 應引流治療
D. 細菌培養呈陽性，應引流治療

正確答案：B. 白血球＞10000/mm3 應引流治療